Clinical trial inclusion criterion:
Patients undergoing colon resection

Entity relations:
- Has_temporal("colon resection", "undergoing")